學齡前的兒童常會被聽到無意義（Innocent）、良性（Benign）、或稱作功能性（Functional）的心雜音 （Heart murmur）。下列那一種心雜音的特徵不太可能是這類型的心雜音？
A. 心雜音的強度達第4級
B. 心雜音的強度會隨著姿勢與呼吸而改變
C. 心雜音僅僅在收縮期出現
D. 第二心音會因吸氣而出現分岔的情形（S2 split）

正確答案：A. 心雜音的強度達第4級